Clinical trial exclusion criterion:
Patients with a seizure history

Entity relations:
- Has_temporal("seizure", "history")